Clinical trial exclusion criterion:
ASA> 3;

Annotated entities:
- Measurement: "ASA"
- Value: "> 3"